下列有關帕金森氏症（Parkinson disease）的敘述，何者錯誤？
A. 和大腦黑質（substantia nigra）裡多巴胺受體（dopaminergic receptor）數量減少有關
B. 造成原因也包括中樞神經感染或藥物濫用引發的腦病變
C. 症狀包括意向性顫抖（intention tremor）、肢體僵硬（rigidity）及動作緩慢（bradykinesia）等
D. 即使藥物治療，神經退化仍是會持續進展

正確答案：C. 症狀包括意向性顫抖（intention tremor）、肢體僵硬（rigidity）及動作緩慢（bradykinesia）等